有關大腸pseudo-obstruction的描述，下列何者錯誤？
A. 又稱為Ogilvie's syndrome，是在西元1948被提出的診斷
B. 臨床上常見的大腸pseudo-obstruction原因以secondary為主，主要和合併使用嗎啡類止痛藥、甲狀腺機能異常、糖尿病、腎毒症等因素有關
C. 治療方式可以考慮利用大腸鏡做診斷和減壓，不過要小心慎選病患，若懷疑大腸壞死就不可以施行
D. 藥物治療可以考慮neostigmine，不過要小心病患施打藥物後會有bradycardia，需要仔細觀察心率變化，和準備dopamine作為緊急解毒劑

正確答案：D. 藥物治療可以考慮neostigmine，不過要小心病患施打藥物後會有bradycardia，需要仔細觀察心率變化，和準備dopamine作為緊急解毒劑